Which is the major function of sororin?

Sororin is a positive regulator of sister chromatid cohesion that interacts with the cohesin complex.